關於睪丸扭轉（Testicular torsion）的敘述，下列何者錯誤？
A. 主要是因為供應睪丸的動脈受阻塞
B. 嬰兒型不會有相關解剖構造的異常
C. 成年型為預防另一側睪丸也發生扭轉，需施以手術將睪丸固定
D. 須緊急手術，黃金時間為發生後 6 小時內

正確答案：A. 主要是因為供應睪丸的動脈受阻塞